Left ventricular ejection fraction <35%

The above is a clinical trial inclusion criterion. Annotated with entity spans:
[Measurement: Left ventricular ejection fraction] [Value: <35%]